1. Women 18 to 40 years of age inclusive who can give written informed consent

The above is a clinical trial inclusion criterion. Annotated with entity spans:
1. [Person: Women] [Value: 18 to 40 years] of [Person: age] inclusive who [Observation: can give written informed consent]